have a negative urine or blood pregnancy test at enrolment and prior to randomization;

The above is a clinical trial inclusion criterion. Annotated with entity spans:
[Pregnancy_considerations: have a negative urine or blood pregnancy test at enrolment and prior to randomization;]